Clinical trial inclusion criterion:
Patients with PA and stage I (140-159/90-99 mmHg) hypertension

Annotated entities:
- Condition: "PA"
- Condition: "hypertension"
- Qualifier: "stage I"